Clinical trial exclusion criterion:
12. Heart rate <50 at time of screening

Entity relations:
- Has_value("Heart rate", "<50")
- Has_temporal("Heart rate", "at time of screening")
- Has_index("at time of screening", "time of screening")